Patients under law protection

The above is a clinical trial exclusion criterion. Annotated with entity spans:
[Non-query-able: Patients under law protection]